El término “lámina propia” equivale a:
1. Lámina basal.
2. Lámina elástica interna.
3. Lámina nuclear.
4. Lámina reticular.
5. Tejido conjuntivo laxo.

Respuesta correcta: 5. Tejido conjuntivo laxo.